Clinical trial exclusion criteria:
pregnant or breastfeeding woman
patient with a measure of legal protection
subject unaffiliated insurance

Annotated entities:
- Pregnancy_considerations: "pregnant or breastfeeding woman"
- Post-eligibility: "patient with a measure of legal protection"
- Non-query-able: "subject unaffiliated insurance"